Where can we find the protein lacritin?

The protein lacritin can be found in lacrimal and salivary glands as well as in tear fluid and in the thyroid.